關於 Hepatitis D virus（Delta agent）之敘述，下列何者正確？
A. 是 HBV 的缺陷突變（defective mutant）
B. 在病毒形成時需要 HBV 表面抗原（surface antigen）
C. 和 HCV 有關
D. 含雙股 DNA 病毒

正確答案：B. 在病毒形成時需要 HBV 表面抗原（surface antigen）